下列關於頭頸癌的敘述何者錯誤？
A. 在西方國家，人類乳突病毒（human papilloma virus）與口咽部（oropharynx）頭頸癌的發生率增加有關
B. 人類乳突病毒相關的頭頸癌與人類乳突病毒不相關的頭頸癌比較，預後較差
C. 早期頭頸癌治療後，有可能在頭頸其他部位、肺部、食道出現第二原發（second primary）癌症
D. 晚期頭頸癌有效的藥物治療，包括化學治療、標靶治療

正確答案：B. 人類乳突病毒相關的頭頸癌與人類乳突病毒不相關的頭頸癌比較，預後較差